concomitant disease which must be treated with antibiotics

The above is a clinical trial exclusion criterion. Annotated with entity spans:
[Temporal: concomitant] [Condition: disease] which must be [Procedure: treated] with [Drug: antibiotics]